Heart disease

The above is a clinical trial exclusion criterion. Annotated with entity spans:
[Condition: Heart disease]